Clinical trial exclusion criterion:
current or past diagnosis of bipolar and other related disorders, schizophrenia spectrum, or other psychotic disorders

Entity relations:
- Has_qualifier("related disorders", "other")
- OR("bipolar", "schizophrenia spectrum", "related disorders", "psychotic disorders")